Paciente de 45 años con hábito tabáquico moderado, no bebedor, sin otros antecedentes de interés que ha sido diagnosticado de un carcinoma escamoso de orofaringe cT1N2b. Está pendiente de decisión de tratamiento en comité. ¿Qué agente infeccioso le interesaría despistar antes de plantear el tratamiento?
1. Helicobacter pylori.
2. Virus Herpes Simple tipo 2.
3. Virus del papiloma humano.
4. Virus de Ebstein Barr.
5. Citomegalovirus.

Respuesta correcta: 3. Virus del papiloma humano.